正子掃瞄（Positron emission tomography, PET）對下列何種情況最有幫忙？
A. 區別縱膈腔淋巴結是結核或腫瘤轉移
B. 診斷支氣管肺泡細胞癌（bronchoalveolar carcinoma）
C. 診斷肺癌之全身遠處轉移
D. 肺癌合併有糖尿病患者之鑑別診斷

正確答案：C. 診斷肺癌之全身遠處轉移